Clinical trial exclusion criterion:
Poorly controlled diabetes (HbA1c > 9.0)

Annotated entities:
- Condition: "diabetes"
- Qualifier: "Poorly controlled"
- Measurement: "HbA1c"
- Value: "> 9.0"